Clinical trial inclusion criterion:
Reassuring fetal health assessment (no abnormal findings in fetal assessment, see below)

Annotated entities:
- Value: "Reassuring"
- Measurement: "fetal health assessment"
- Negation: "no"
- Condition: "abnormal findings"
- Procedure: "fetal assessment"